Inpatients having major foot and ankle surgery that will benefit from continuous popliteal sciatic nerve block with an indwelling catheter

The above is a clinical trial inclusion criterion. Annotated with entity spans:
[Visit: Inpatients] having [Procedure: major foot and ankle surgery] that will benefit from [Qualifier: continuous] [Procedure: popliteal sciatic nerve block] with an [Device: indwelling catheter]